Clinical trial inclusion criterion:
H pylori infection failed after at least two eradication therapies

Annotated entities:
- Condition: "H pylori infection"
- Procedure: "eradication therapies"
- Multiplier: "at least two"
- Qualifier: "failed"